Clinical trial inclusion criterion:
Hemoglobin >9 g/dL (Note: Patients may be transfused or receive erythropoietin to maintain or exceed this level).

Entity relations:
- Has_value("Hemoglobin", ">9 g/dL")